Clinical trial exclusion criteria:
Target lesion located in the left main stem
STEMI
Restenosis
Cardiogenic shock
Malignancies or other comorbid conditions with life expectancy less than 12 months or that may result in protocol noncompliance
Known allergy to the study medications (probucol, sirolimus, zotarolimus)
Pregnancy (present, suspected, or planned)

Annotated entities:
- Condition: "Target lesion"
- Qualifier: "left main stem"
- Condition: "STEMI"
- Condition: "Restenosis"
- Condition: "Cardiogenic shock"
- Condition: "Malignancies"
- Condition: "comorbid conditions"
- Qualifier: "other"
- Observation: "life expectancy"
- Value: "less than 12 months"
- Observation: "protocol noncompliance"
- Mood: "may"
- Condition: "allergy"
- Drug: "study medications"
- Drug: "probucol"
- Drug: "sirolimus"
- Drug: "zotarolimus"
- Condition: "Pregnancy"
- Temporal: "present"
- Mood: "suspected"
- Mood: "planned"